9. >18 years of age.

The above is a clinical trial inclusion criterion. Annotated with entity spans:
9. [Value: >18 years] of [Person: age].